Clinical trial inclusion criterion:
between 18-80 years old

Entity relations:
- Has_value("old", "between 18-80 years")